Clinical trial exclusion criterion:
History of diabetic ketoacidosis, precoma diabetica, or diabetic coma

Entity relations:
- Has_temporal("diabetic ketoacidosis", "History")
- OR("diabetic ketoacidosis", "diabetic coma", "precoma diabetica")